Clinical trial inclusion criteria:
Patients are of American Society of Anesthesiologists (ASA) physical status I and II, aged 8-14 years old, of both gender, with suspected acute appendicitis scheduled for laparoscopic appendicectomy.

Annotated entities:
- Measurement: "American Society of Anesthesiologists physical status"
- Measurement: "ASA"
- Value: "I and II"
- Person: "aged"
- Value: "8-14 years old"
- Person: "both gender"
- Mood: "suspected"
- Condition: "acute appendicitis"
- Mood: "scheduled for"
- Procedure: "laparoscopic appendicectomy"